Describe the Enhancing NeuroImaging Genetics through Meta-Analysis (ENIGMA) Consortium

The ENIGMA Consortium is a collaborative network of researchers working together on a range of large-scale studies that integrate data from 70 institutions worldwide. Organized into Working Groups that tackle questions in neuroscience, genetics, and medicine, EnIGMA studies have analyzed neuroimaging data from over 12,826 subjects. By meta-analyzing results from many sites, they have detected factors that affect the brain that no individual site could detect on their own, and that require larger numbers of subjects than any individual study has currently collected.